Respecto a los Tumores del Estroma Gastrointestinal (GIST), es cierto que:
1. Se trata de tumores de origen epitelial, localizados sobre todo a nivel de la mucosa del tubo digestivo.
2. Es característico de estos tumores la mutación del gen c-kit, que codifica un receptor tirosina-cinasa.
3. El tratamiento de los tumores localizados menores de 2 cms es fundamentalmente médico, con el empleo de Imatinib.
4. Son tumores que sólo excepcionalmente sangran.
5. La localización más frecuente de estos tumores es el intestino delgado.

Respuesta correcta: 2. Es característico de estos tumores la mutación del gen c-kit, que codifica un receptor tirosina-cinasa.